La hiperoxia o toxicidad por oxígeno puede provocar signos y síntomas como:
1. Dolor subesternal.
2. Parestesias de las extremidades.
3. Fatiga y malestar general.
4. Disnea y dificultad respiratoria progresiva.
5. Todas son ciertas.

Respuesta correcta: 5. Todas son ciertas.